Current TB or TB treatment in = 6 months (contain active antibiotics against Orientia spp.)

The above is a clinical trial exclusion criterion. Annotated with entity spans:
Current [Condition: TB] or [Procedure: TB treatment] [Temporal: in = 6 months] (contain active antibiotics against Orientia spp.)